Señale la afirmación INCORRECTA acerca de la conducta sexual inapropiada que se produce en algunas víctimas de abuso sexual infantil:
1. Es un problema común en los menores que han sufrido abuso sexual.
2. Es un síntoma que constituye un criterio diagnóstico del trastorno de estrés postraumático y por lo tanto se espera que desaparezca si se trata adecuadamente el TEPT mediante técnicas como la exposición.
3. Puede trabajarse con los padres y también directamente con los menores.
4. Su tratamiento puede incluir un componente de educación sexual también en niños prepúberes.
5. La implicación de los padres incluye su deber de proteger y mantener seguro al menor.

Respuesta correcta: 2. Es un síntoma que constituye un criterio diagnóstico del trastorno de estrés postraumático y por lo tanto se espera que desaparezca si se trata adecuadamente el TEPT mediante técnicas como la exposición.